Clinical trial exclusion criterion:
Significant alcohol intake

Entity relations:
- Has_qualifier("alcohol intake", "Significant")